Subjects with a significant risk of violent behaviour or a significant risk of committing suicide based on history or investigator's judgment.

The above is a clinical trial exclusion criterion. Annotated with entity spans:
Subjects with a [Mood: significant risk] of [Observation: violent behaviour] or a [Mood: significant risk] of [Condition: committing suicide] based on history or investigator's judgment.